What is the effect of amitriptyline in the mdx mouse model of Duchenne muscular dystrophy?

Amitriptyline is efficacious in ameliorating muscle inflammation and depressive symptoms in the mdx mouse model of Duchenne muscular dystrophy